NA

The above is a clinical trial exclusion criterion. Annotated with entity spans:
[Non-query-able: NA]